下列關於細胞激素的敘述，何者正確？
A. 具抗原特異性（antigen specificity）
B. 在免疫細胞之間作用，但不會與其他器官作用
C. 作用在特定的受體（receptor）並活化訊息傳遞路徑
D. 彼此有協同（synergistic）作用，但沒有拮抗（antagonistic）作用

正確答案：C. 作用在特定的受體（receptor）並活化訊息傳遞路徑